胃底折疊術（fundoplication）不是下列那一個疾病手術中的一個術式？
A. 食管裂孔疝氣（hiatal hernia）
B. 胃食道逆流（gastro-esophageal reflux）
C. 血管環（vascular ring）
D. 賁門弛緩不能症（achalasia）

正確答案：C. 血管環（vascular ring）